在臺灣，虎皮蛙（Rana rugulosa）及金線蛙（Rana plancyi）是下列何種人類寄生蟲的保蚴宿主（paratenic  host）？
A. 廣東住血線蟲（Angiostrongylus cantonensis）
B. 菲律賓毛線蟲（Capillaria philippinensis）
C. 廣節裂頭絛蟲（Diphyllobothrium latum）
D. 衛氏肺吸蟲（Paragonimus westermani）

正確答案：A. 廣東住血線蟲（Angiostrongylus cantonensis）